Controls (without a history of TBI):

The above is a clinical trial inclusion criterion. Annotated with entity spans:
[Parsing_Error: Controls (without a history of TBI):]